Clinical trial exclusion criterion:
Patients under law protection

Annotated entities:
- Non-query-able: "Patients under law protection"